Clinical trial inclusion criteria:
Male participants between 18 and 40 years-old
Written informed consent signed by the participant

Annotated entities:
- Person: "Male"
- Value: "between 18 and 40 years"
- Person: "old"
- Informed_consent: "Written informed consent signed by the participant"